Acude a consulta de enfermería un hombre de 38 años que refiere haber mantenido prácticas sexuales de riesgo con una fuente + VHB. El resultado de la serología realizada es de HBsAc>10mUl/ml. Teniendo en cuenta los datos aportados, ¿qué intervención está indicada?:
1. Administración inmediata de la lgHB, iniciar vacunación VHB y EpS de prácticas de sexo seguro.
2. Sólo administración inmediata de la lgHB y EpS de prácticas de sexo seguro.
3. Poner dosis de recuerdo VHB y EpS de prácticas de sexo seguro.
4. Iniciar vacunación y EpS de prácticas de sexo seguro.
5. EpS de prácticas de sexo seguro.

Respuesta correcta: 5. EpS de prácticas de sexo seguro.